7 歲女童主訴過去一個多月來有間歇性臍周圍腹痛。她常在晚間睡覺時痛醒，且常有噁心，並有體重減輕之現象，下列何者最不可能是此女童的診斷？
A. 膽道囊腫（choledochocyst）
B. 消化性潰瘍（peptic ulcer）
C. 克隆氏症（Crohn's disease）
D. 機能性腹痛（functional abdominal pain）

正確答案：D. 機能性腹痛（functional abdominal pain）